Clinical trial exclusion criterion:
Denial of signing the consent form.

Entity relations:
- Has_negation("signing the consent form", "Denial of")